Clinical trial exclusion criteria:
Advanced male factor infertility.
Polycystic ovary syndrome (PCOS) as defined by the Rotterdam criteria.
Endometriosis.
Tubal disease.
Uterine abnormalities or myoma.
Previous uterine surgery.
Metabolic or hormonal abnormalities.

Annotated entities:
- Qualifier: "Advanced"
- Condition: "male factor infertility"
- Condition: "Polycystic ovary syndrome (PCOS)"
- Qualifier: "Rotterdam criteria"
- Condition: "Endometriosis"
- Condition: "Tubal disease"
- Condition: "Uterine abnormalities"
- Condition: "myoma"
- Procedure: "uterine surgery"
- Temporal: "Previous"
- Condition: "Metabolic abnormalities"
- Condition: "hormonal abnormalities"